What rare disease is associated with a mutation in the GPC6 gene on chromosome 13?

The glypican 6 gene (GPC6), which was recently reported as a candidate for autosomal recessive omodysplasia.